Person who is not available to follow the entire study protocol.

The above is a clinical trial exclusion criterion. Annotated with entity spans:
[Post-eligibility: Person who is not available to follow the entire study protocol].